Clinical trial exclusion criterion:
Patients with galactose intolerance, lapp lactase deficiency or glucose-galactose malabsorption.

Annotated entities:
- Condition: "galactose intolerance"
- Condition: "lapp lactase deficiency"
- Condition: "glucose-galactose malabsorption"